¿Qué es la terapia interpersonal del ritmo social (o terapia interpersonal y del ritmo social)?
1. Una adaptación de la terapia interpersonal al tratamiento del trastorno distímico.
2. Una adaptación de la terapia interpersonal al tratamiento del trastorno depresivo mayor grave.
3. Una terapia resultante de combinar la terapia interpersonal, la terapia de activación conductual y la terapia de solución de problemas sociales.
4. Una adaptación de la terapia interpersonal para los pacientes con trastorno depresivo mayor que tienen problemas graves en sus relaciones sociales.
5. Una adaptación de la terapia interpersonal al tratamiento del trastorno bipolar.

Respuesta correcta: 5. Una adaptación de la terapia interpersonal al tratamiento del trastorno bipolar.